Clinical trial exclusion criterion:
Systolic blood pressure = 180 mmHg or diastolic blood pressure = 110 mm Hg at the baseline visit.

Annotated entities:
- Measurement: "Systolic blood pressure"
- Value: "= 180 mmHg"
- Measurement: "diastolic blood pressure"
- Value: "= 110 mm Hg"
- Temporal: "at the baseline visit"